Which R/bioconductor package exists for discovery of intergenic transcripts?

PRAM is a novel pooling approach for discovering intergenic transcripts from large-scale RNA sequencing experiments. PRAM is implemented as an R/Bioconductor package. It covers raw reads alignment, RNA methylation site detection, motif discovery and functional analysis. More than 50% of reconstructed transcripts represent novel transcriptome elements, including 8,343 novel exons and exon extensions of annotated coding genes, 11,217 novel antisense transcripts and 29,541 novel intergenic transcript or their fragments showing canonical features of long non-coding RNAs (lncRNAs).